patient known and treated for sleep apnea syndrome

The above is a clinical trial exclusion criterion. Annotated with entity spans:
patient known and [Procedure: treated] for [Condition: sleep apnea syndrome]